Clinical trial exclusion criterion:
Uncontrolled epilepsy (seizure within 6 months prior to consent)

Entity relations:
- Has_value("seizure", "within 6 months prior to consent")
- Subsumes("Uncontrolled epilepsy", "seizure")